Willing and able to return for all study visits.

The above is a clinical trial inclusion criterion. Annotated with entity spans:
[Post-eligibility: Willing and able to return for all study visits.]